Clinical trial exclusion criterion:
Subjects with HIV positive result at the screening

Annotated entities:
- Condition: "HIV positive"
- Temporal: "at the screening"